HIV seropositivity

The above is a clinical trial exclusion criterion. Annotated with entity spans:
[Measurement: HIV] [Value: seropositivity]